Clinical trial inclusion criterion:
Clinically diagnosed autoimmune encephalitis

Entity relations:
- Has_qualifier("autoimmune encephalitis", "Clinically diagnosed")